What do HA and NA stand for with respect to the flue virus, e.g. H1N1?

HA and NA stand for  hemagglutinin (HA) and neuraminidase (NA), two components of the flue virus genome.